Clinical trial inclusion criterion:
Aged 18 years or older, male or female.

Annotated entities:
- Person: "Aged"
- Value: "18 years or older"
- Person: "male"
- Person: "female"